=6 weeks postnatal age at randomization

The above is a clinical trial inclusion criterion. Annotated with entity spans:
[Value: =6 weeks] [Measurement: postnatal age] [Temporal: at randomization]